What is the basis of the BLISS technique?

Breaks Labeling In Situ and Sequencing (BLISS) is a versatile and quantitative method for genome-wide profiling of DNA double-strand breaks.